Clinical trial exclusion criterion:
regular consumption of medication with potential hepatotoxicity.

Entity relations:
- AND("hepatotoxicity", "medication")